Clinical trial exclusion criterion:
History of local radiation therapy in the last five years.

Entity relations:
- Has_temporal("local radiation therapy", "last five years")